Clinical trial exclusion criterion:
Long-term use of NSAIDs

Annotated entities:
- Drug: "NSAIDs"
- Multiplier: "Long-term use"